缺乏下列何種營養素最常導致腳氣病（beriberi）？
A. 硫胺素（thiamine）
B. 核黃素（riboflavin）
C. 菸鹼酸（niacin）
D. 維生素 B6（pyridoxine）

正確答案：A. 硫胺素（thiamine）